Age 18 years

The above is a clinical trial inclusion criterion. Annotated with entity spans:
[Person: Age] [Value: 18 years]